Clinical trial exclusion criteria:
Pregnant or nursing (lactating) women
HIV positivity
Need for dual organ transplant
Any contra-indication to liver transplantation per center protocol

Annotated entities:
- Condition: "Pregnant"
- Observation: "nursing"
- Observation: "lactating"
- Person: "women"
- Condition: "HIV positivity"
- Measurement: "HIV"
- Value: "positivity"
- Procedure: "dual organ transplant"
- Mood: "Need for"
- Condition: "contra-indication"
- Procedure: "liver transplantation"